Clinical trial inclusion criterion:
Blood pressured controlled at 150/100 mHg following drug administration;

Annotated entities:
- Measurement: "Blood pressured"
- Qualifier: "controlled"
- Value: "150/100 mHg"